6. History of any hypersensitivity or allergic reaction to any β-lactam antibacterial agent.

The above is a clinical trial exclusion criterion. Annotated with entity spans:
6. [Temporal: History] of any [Condition: hypersensitivity] or [Condition: allergic reaction] to any [Drug: β-lactam antibacterial agent].